Clinical trial inclusion criterion:
NYHA Class III: Subjects with cardiac disease resulting in marked limitation of physical activity. They are comfortable at rest. Less than ordinary physical activity causes fatigue, palpitation, dyspnea, or anginal pain.

Entity relations:
- Has_value("NYHA", "Class III")